Clinical trial exclusion criterion:
Score greater than "0" on the Ocular Pain Assessment in the study eye at Screening

Annotated entities:
- Measurement: "Ocular Pain Assessment"
- Value: "greater than "0""
- Temporal: "at Screening"